Fasting glucose < 7,0 mM, HbA1c < 48 mmol/mol 3 months after RYGB

The above is a clinical trial inclusion criterion. Annotated with entity spans:
[Measurement: Fasting glucose] [Value: < 7,0 mM], [Measurement: HbA1c] [Value: < 48 mmol/mol] [Temporal: 3 months after RYGB]